Clinical trial exclusion criterion:
Patients with sensitivity to botulinum toxin or human albumin

Annotated entities:
- Drug: "botulinum toxin"
- Drug: "human albumin"
- Condition: "sensitivity"